What is the purpose of the 123 dihydrorhodamine assay?

detection of inheritance pattern in thirty-three mexican males with chronic granulomatous disease